Clinical trial inclusion criterion:
Subject is ≥ 18 years of age

Annotated entities:
- Person: "age"
- Value: "≥ 18 years"